Clinical trial exclusion criterion:
History of taking coumadin or similar anticoagulant, have a known coagulopathy, bleeding dyscrasia, or platelet count < 150,000/cubic mm

Annotated entities:
- Drug: "coumadin"
- Drug: "anticoagulant"
- Condition: "coagulopathy"
- Condition: "bleeding dyscrasia"
- Measurement: "platelet count"
- Value: "< 150,000/cubic mm"